Aminoglycosides 是殺菌類藥物，是目前臨床上治療革蘭氏陰性菌感染的有效藥物，但是該類藥物卻無法用於治療 Bacteroides fragilis 引起之菌血症，主要原因為何？
A. Bacteroides fragilis 並非革蘭氏陰性菌
B. aminoglycosides 無法與 Bacteroides fragilis 的核糖體結合
C. Bacteroides fragilis 是厭氧菌
D. Bacteroides fragilis 沒有細胞壁結構

正確答案：C. Bacteroides fragilis 是厭氧菌